ischemic heart disease;

The above is a clinical trial exclusion criterion. Annotated with entity spans:
[Condition: ischemic heart disease];